Clinical trial exclusion criteria:
Contraindications for BB.
Living in a nursing home.
Life expectancy < 6 months.
Unable to self-care or mental disease without caregiver.
Unable to weight
Without phone
Unable to go to clinic visit.

Annotated entities:
- Condition: "Contraindications"
- Drug: "BB"
- Visit: "nursing home"
- Observation: "Living"
- Observation: "Life expectancy"
- Value: "< 6 months"
- Condition: "Unable to self-care"
- Condition: "mental disease"
- Qualifier: "without caregiver"
- Procedure: "weight"
- Condition: "Unable"
- Observation: "phone"
- Negation: "Without"
- Observation: "Unable"
- Observation: "go to clinic visit"